下列營養素何者無法直接提供能量？
A. 醣類
B. 蛋白質
C. 維生素
D. 脂肪

正確答案：C. 維生素